為研究大腸癌病人術前準備情況與術後併發症的關係，某研究收集6位術前準備情況較好之大腸癌病人與 4 位術前準備情況較差者，術後兩組發生倂發症的人數分別為 1 位與 3 位。下列何種統計方法最恰當？
A. 費雪恰當檢定（Fisher's exact test）
B. 獨立樣本 t檢定（Independent sample t-test）
C. 卡方檢定（Chi-square test）
D. McNemar 檢定 (McNemar test)

正確答案：A. 費雪恰當檢定（Fisher's exact test）